下列腫瘤的組織學型態，何者與其他三者相差 多？
A. 縱膈腔的卵黃囊腫瘤（yolk sac tumor）
B. 睪丸的精細胞瘤（seminoma）
C. 卵巢的 dysgerminoma
D. 松果腺地區的 germinoma

正確答案：A. 縱膈腔的卵黃囊腫瘤（yolk sac tumor）